Los seres humanos NO pueden sintetizar glucosa a partir de:
1. Glicerol.
2. Alanina.
3. Palmitato.
4. Propinil-CoA.

Respuesta correcta: 3. Palmitato.